Inborn preterm infants born between 28 0/7 and 34 0/7 weeks gestation and fed either mother's own milk or donor human milk

The above is a clinical trial inclusion criterion. Annotated with entity spans:
[Condition: Inborn] [Condition: preterm] [Person: infants] born [Value: between 28 0/7 and 34 0/7 weeks] [Measurement: gestation] and [Observation: fed] either mother's own milk or [Observation: donor human milk]